El dimetilsulfóxido (DMSO):
1. Es un disolvente polar prótico.
2. Es un disolvente polar aprótico.
3. No es un disolvente.
4. Es un sólido incoloro.
5. Ninguna de las anteriores.

Respuesta correcta: 2. Es un disolvente polar aprótico.